Which diseases are caused by mutations in Calsequestrin 2 (CASQ2) gene?

Mutations in the gene encoding for cardiac calsequestrin, CASQ2, cause a rare but severe form of catecholaminergic polymorphic ventricular tachycardia (CPVT).
There is also a publication that links mutations in CASQ2 gene to the disease of hypertrophic cardiomyopathy (HCM).